Clinical trial exclusion criterion:
Myelodysplastic syndrome (MDS) or myelofibrosis;

Annotated entities:
- Condition: "Myelodysplastic syndrome (MDS)"
- Condition: "myelofibrosis"